With which cancers has the loss of SMARCB1 been associated?

The diagnosis is all the more challenging that other poorly differentiated cancers lose SMARCB1 expression, such as epithelioid sarcomas (ES), renal medullary carcinomas (RMC) or undifferentiated chordomas (UC) Loss of SMARCB1/INI1 expression is considered to be a hallmark for childhood chordomas (CCs)